Clinical trial exclusion criterion:
Lumbar spinal surgery within the preceding six months

Entity relations:
- Has_temporal("Lumbar spinal surgery", "within the preceding six months")